Clinical trial exclusion criterion:
Uncontrolled medical problems including pulmonary, cardiovascular or orthopedic disease

Annotated entities:
- Qualifier: "Uncontrolled"
- Condition: "medical problems"
- Condition: "pulmonary disease"
- Condition: "cardiovascular disease"
- Condition: "orthopedic disease"